Inborn errors of metabolism

The above is a clinical trial exclusion criterion. Annotated with entity spans:
[Condition: Inborn errors of metabolism]